Clinical trial inclusion criterion:
Clinically significant apathy for at least four weeks for which either 1) the frequency of apathy as assessed by the Neuropsychiatric Inventory (NPI) is 'Very frequently', or 2) the frequency of apathy as assessed by the NPI is 'Frequently' or 'Often' AND the severity of apathy as assessed by the NPI is 'Moderate' or 'Marked'

Annotated entities:
- Condition: "apathy"
- Person: "at least four weeks"
- Measurement: "Neuropsychiatric Inventory (NPI)"
- Value: "Very frequently"
- Measurement: "NPI"
- Value: "Frequently"
- Value: "Often"
- Measurement: "NPI"
- Observation: "severity of apathy"
- Observation: "frequency of apathy"
- Value: "Moderate"
- Value: "Marked"
- Observation: "frequency of apathy"